What is herceptin?

Trastuzumab (Herceptin(r) [H]) is the standard of care for HER2-positive locally advanced/metastatic breast cancer and gastric/gastroesophageal junction (GEJ) cancer.